Clinical trial inclusion criterion:
Tenofovir disoproxil fumarate (TDF) to tenofovir alafenamide fumarate (TAF)/TAF-containing fixed-dose combination regimens

Annotated entities:
- Drug: "Tenofovir disoproxil fumarate (TDF)"
- Drug: "tenofovir alafenamide fumarate (TAF)"
- Procedure: "TAF-containing fixed-dose combination regimens"